female subjects of childbearing potential must have a negative pregnancy test.

The above is a clinical trial inclusion criterion. Annotated with entity spans:
[Person: female] subjects of [Condition: childbearing potential] must have a [Value: negative] [Measurement: pregnancy test].